Clinical trial inclusion criterion:
Prostate volume > 100 cc

Entity relations:
- Has_value("Prostate volume", "> 100 cc")